What is the incidence of beta-thalassemia in Greek population?

The incidence of beta-thalassemia trait is 8% in Greek population.